Clinical trial exclusion criterion:
Presence of intracardiac thrombus, myxoma, tumor, interatrial baffle or patch or other abnormality that precludes vascular access, or manipulation of the catheter.

Entity relations:
- Has_qualifier("abnormality", "other")
- AND("precludes", "vascular access")
- AND("abnormality", "precludes")
- OR("vascular access", "manipulation of the catheter")
- OR("intracardiac thrombus", "myxoma", "tumor", "interatrial baffle", "patch", "abnormality")